Currently participate in a resistance training or high impact weight bearing exercise program two or more times weekly

The above is a clinical trial exclusion criterion. Annotated with entity spans:
Currently [Condition: participate in a resistance training] or high impact weight bearing exercise program [Multiplier: two or more times weekly]